病例對照研究中，為了要探討危險因子單獨對於疾病發生的作用，病例組應選取那種病人？
A. 新發病者
B. 久病未癒者
C. 復發者
D. 得病後改變行為者

正確答案：A. 新發病者